Clinical trial exclusion criterion:
Active malignancy or history of malignancy.

Annotated entities:
- Temporal: "history"
- Condition: "malignancy"
- Condition: "malignancy"
- Qualifier: "Active"